下列那一個致病菌目前沒有效的抗微生物製劑治療，且必須進行特殊隔離，以免傳播給其他人？
A. 嚴重急性呼吸道症候群（severe acute respiratory syndrome）
B. 吸入型炭疽病（anthrax）
C. 漢生病（Hansen's disease）
D. 流行性感冒

正確答案：A. 嚴重急性呼吸道症候群（severe acute respiratory syndrome）